La determinación de la concentración de una de las siguientes proteínas en suero nos puede dar información de una posible anemia hemolítica. Indique cuál:
1. Transferrina.
2. Hemosiderina.
3. Ceruloplasmina.
4. Ferritina.
5. Haptoglobina.

Respuesta correcta: 5. Haptoglobina.